下列何種物質可直接經由cyclooxygenase的作用，產生前列凝素（thromboxanes）？
A. 乙醯輔酶A（acetyl-CoA）
B. 棕櫚酸（palmitate）
C. 硬脂酸（stearate）
D. 花生四烯酸（arachidonate）

正確答案：D. 花生四烯酸（arachidonate）